Clinical trial exclusion criterion:
presence of mobility in the selected tooth

Entity relations:
- Has_qualifier("mobility", "selected tooth")